El ADN recombinante es:
1. Una molécula de ADN que activa la recombinación heteróloga.
2. Una molécula de ARN mensajero precursor.
3. Una molécula de ADN compuesta de segmentos unidos covalentemente procedentes de dos o más fuentes.
4. Una molécula de ADN diploide.
5. Un complejo multienzimático de ADN polimerasas unidas covalentemente.

Respuesta correcta: 3. Una molécula de ADN compuesta de segmentos unidos covalentemente procedentes de dos o más fuentes.